Clinical trial exclusion criterion:
Ongoing ocular infection or inflammation in either eye.

Entity relations:
- OR("ocular infection", "ocular inflammation")